history of uterine surgery

The above is a clinical trial exclusion criterion. Annotated with entity spans:
[Temporal: history] of [Procedure: uterine surgery]